Where is the protein protamine 2 expressed?

Human sperm express two types of protamine: protamine 1 (P1) and the family of protamine 2 (P2) proteins.